骨科手術後最常見的傷口感染細菌，下列何者正確？
A. Candida
B. Enterococcus
C. Staphylococcus
D. Pseudomonas

正確答案：C. Staphylococcus